Se sintetiza a partir de ácido araquidónico:
1. Prostaglandinas.
2. Hormonas esteroideas.
3. Hemoglobina.
4. Colesterol.

Respuesta correcta: 1. Prostaglandinas.